Clinical trial exclusion criterion:
1. Deny to sign the informed consent;

Annotated entities:
- Post-eligibility: "Deny to sign the informed consent;"
- Non-query-able: "Deny to sign the informed consent;"